Clinical trial inclusion criterion:
Subjects must have received no more than 2 prior systemic therapies for lymphoma. Prior therapy with systemic rituximab monotherapy or conventional chemotherapy (i.e. bendamustine, CVP (Cyclophosphamide, Vincristine Sulfate, Prednisone) or other) ± rituximab for indolent non-Hodgkin's lymphoma (NHL) ± maintenance/extended-use rituximab will count as 1 line of systemic therapy.

Entity relations:
- Has_temporal("systemic therapies for lymphoma", "prior")
- Has_multiplier("systemic therapies for lymphoma", "no more than 2")
- AND("systemic monotherapy", "rituximab")
- Subsumes("CVP", "Cyclophosphamide")
- Has_qualifier("non-Hodgkin's lymphoma (NHL)", "indolent")
- Subsumes("conventional chemotherapy", "bendamustine")
- AND("rituximab", "non-Hodgkin's lymphoma (NHL)")
- Has_qualifier("rituximab", "maintenance")
- Subsumes("CVP", "Vincristine Sulfate")
- Subsumes("CVP", "Prednisone")
- OR("bendamustine", "CVP")
- OR("systemic monotherapy", "conventional chemotherapy")
- OR("maintenance", "extended-use")